Clinical trial exclusion criterion:
Disseminated Intravascular Coagulation (DIC) attributable to heparin-induced thrombocytopenia.

Entity relations:
- Subsumes("Disseminated Intravascular Coagulation", "DIC")
- AND("Disseminated Intravascular Coagulation", "heparin-induced thrombocytopenia")